History of neuropathy

The above is a clinical trial exclusion criterion. Annotated with entity spans:
History of [Condition: neuropathy]